Clinical trial exclusion criterion:
allergic history to dexmedetomidine

Annotated entities:
- Condition: "allergic"
- Temporal: "history"
- Drug: "dexmedetomidine"